肺結核是全球常見的疾病，對於抗結核藥物的副作用，何者最不可能？
A. Rifampin 會引起聽神經障礙
B. Isoniazid 會引起肝毒性或週邊性神經炎
C. Ethambutol 會引起視神經炎
D. Pyrazinamide 具肝毒性

正確答案：A. Rifampin 會引起聽神經障礙